Clinical trial inclusion criterion:
6. Negative pregnancy test

Annotated entities:
- Measurement: "pregnancy test"
- Value: "Negative"